Patients with diagnosis of cerebral palsy.

The above is a clinical trial inclusion criterion. Annotated with entity spans:
Patients with diagnosis of [Condition: cerebral palsy].